Clinical trial exclusion criterion:
Previous history of receiving rabies immune globulin.

Annotated entities:
- Drug: "rabies immune globulin"
- Temporal: "Previous history"